Clinical trial exclusion criteria:
Heavy tobacco smokers
Drug and / or alcohol abusers

Annotated entities:
- Condition: "Heavy tobacco smokers"
- Condition: "alcohol abusers"
- Condition: "Drug abusers"